Clinical trial inclusion criterion:
Age = 15 years old

Entity relations:
- Has_value("Age", "= 15 years old")